與男性陰囊（scrotum）發育同源的女性構造是？
A. 大陰唇（labium majora）
B. 小陰唇（labium minora）
C. 陰蒂（clitoris）
D. 前庭球（bulbs of the vestibule）

正確答案：A. 大陰唇（labium majora）